Clinical trial inclusion criterion:
Females of childbearing potential: negative serum or urine pregnancy test

Entity relations:
- AND("Females", "childbearing potential")
- Has_value("serum pregnancy test", "negative")
- OR("serum pregnancy test", "urine pregnancy test")